Sigmoid colon volvulus 的 associated factor 不包括下列那一項？
A. Aging
B. High fiber and vegetable diet
C. Malrotation
D. Psychotropic medication

正確答案：C. Malrotation